Clinical trial exclusion criterion:
Evidence or history of clinically significant allergic reactions to varenicline

Annotated entities:
- Condition: "allergic"
- Drug: "varenicline"